Clinical trial exclusion criterion:
History of chronic alcohol consumption and/or drug abuse.

Annotated entities:
- Condition: "chronic alcohol consumption"
- Condition: "drug abuse"
- Temporal: "History"